Clinical trial inclusion criterion:
Type 2 Diabetes

Annotated entities:
- Condition: "Type 2 Diabetes"